Coexisting malignancy

The above is a clinical trial exclusion criterion. Annotated with entity spans:
[Qualifier: Coexisting] [Condition: malignancy]